Clinical trial inclusion criterion:
At least one void.

Entity relations:
- Has_multiplier("void", "At least one")